Clinical trial exclusion criterion:
9. Severe hepatic and renal insufficiency (serum creatinine>2.0 mg /dl, AST or ALT is five times higher than the upper limit of normal range);

Annotated entities:
- Condition: "renal insufficiency"
- Condition: "hepatic insufficiency"
- Measurement: "serum creatinine"
- Value: ">2.0 mg /dl"
- Measurement: "AST"
- Measurement: "ALT"
- Value: "five times higher than the upper limit of normal range"